La definición de Phaneuf: “Proceso organizado y sistemático de búsqueda de información realizada a partir de diversas fuentes, con el fin de descubrir el grado de satisfacción de las diferentes necesidades de la persona, identificar de este modo sus problemas, conocer sus recursos personales y planificar las intervenciones que puedan ayudarla”. Se refiere al concepto de:
1. Proceso de atención de enfermería.
2. Pensamiento crítico.
3. Razonamiento clínico.
4. Valoración.
5. Diagnóstico.

Respuesta correcta: 4. Valoración.